Anti-depressants with anti-cholinergic properties

The above is a clinical trial exclusion criterion. Annotated with entity spans:
[Drug: Anti-depressants] with [Qualifier: anti-cholinergic properties]